Clinical trial exclusion criterion:
tryptophan

Annotated entities:
- Drug: "tryptophan"